Clinical trial inclusion criterion:
Aged between 18-70 years

Annotated entities:
- Person: "Aged"
- Value: "between 18-70 years"